La síntesis de una proteína humana por una bacteria, a la que se le ha introducido DNA humano, demuestra que:
1. La evolución puede ponerse en duda.
2. Las bacterias pueden adquirir núcleo.
3. El código genético es universal.
4. Las proteínas humanas son idénticas a las proteínas de las bacterias.
5. Las bacterias pueden ser patógenas.

Respuesta correcta: 3. El código genético es universal.